La piruvato carboxilasa se activa alostéricamente por uno de los siguientes compuestos, ¿cuál es?
1. Piruvato.
2. Acetil-CoA.
3. Malato.
4. Oxalacetato.
5. NAD+.

Respuesta correcta: 2. Acetil-CoA.